51 歲女性，一年前被診斷為卵巢癌而接受化學治療，最近主訴虛弱及易喘。檢查發現呼吸費力，每分鐘約 28 次，腹部有一 8×5 cm 之腫塊，胸部 X 光顯示左肋膜大量積水。處理病人之呼吸困難，下列何者較適當？
A. 進行肋膜穿刺（thoracocentesis）引流胸水
B. 給予 meperidine
C. 減少液體攝取
D. 給予支氣管擴張劑

正確答案：A. 進行肋膜穿刺（thoracocentesis）引流胸水